Clinical trial inclusion criterion:
Functionally impairing back pain: A baseline score of > 5 on the Roland-Morris Disability Questionnaire

Entity relations:
- Has_value("Roland-Morris Disability Questionnaire", "score of > 5")
- Has_temporal("Roland-Morris Disability Questionnaire", "baseline")
- Has_qualifier("back pain", "Functionally impairing")
- Subsumes("back pain", "Roland-Morris Disability Questionnaire")